Es más característica de los linfocitos Th1 que de los Th2:
1. La interleucina 5.
2. El TGF-beta.
3. La interleucina 10.
4. La interleucina 17.
5. El IFN-γ.

Respuesta correcta: 5. El IFN-γ.